Age 18 years or older

The above is a clinical trial inclusion criterion. Annotated with entity spans:
[Person: Age] [Value: 18 years or older]